一般而言，正常性生活的健康且年輕夫妻嘗試受孕，12 個月後成功機會約為：
A. 90%
B. 70%
C. 50%
D. 30%

正確答案：A. 90%